Clinical trial inclusion criterion:
Written, voluntary informed consent.

Annotated entities:
- Post-eligibility: "Written, voluntary informed consent."
- Non-query-able: "Written, voluntary informed consent."